preoperative history of schizophrenia, epilepsy, parkinsonism, use of cholinesterase inhibitor, inability to communicate in the preoperative period (coma, profound dementia, or language barrier).

The above is a clinical trial exclusion criterion. Annotated with entity spans:
[Temporal: preoperative] [Temporal: history] of [Condition: schizophrenia], [Condition: epilepsy], [Condition: parkinsonism], use of [Drug: cholinesterase inhibitor], [Condition: inability to communicate] in the preoperative period ([Condition: coma], [Condition: profound dementia], or [Condition: language barrier]).